What is the function of GvpA?

The gas vesicle wall is solely formed of proteins with the two major components, GvpA and GvpC, and